先天性代謝異常疾病（inborn errors of metabolism）大多以體染色體隱性方式遺傳（autosomal recessive inheritance），但有少數例外，以性染色體隱性方式（X-linked recessive）遺傳，例如？
A. 先天腎上腺增生症（congenital adrenal hyperplasia）
B. 第一型肝醣儲積症（glycogen storage disease I, von Gierke disease）
C. 第一型黏多醣症（mucopolysaccharidosis I, Hurler syndrome）
D. 葡萄糖-6-磷酸去氫酶（glucose-6-phosphate dehydrogenase）缺乏症

正確答案：D. 葡萄糖-6-磷酸去氫酶（glucose-6-phosphate dehydrogenase）缺乏症